下列關於 B 細胞的敘述，何者錯誤？
A. B 細胞的發育主要發生在骨髓內
B. 大部分 B 細胞在成熟過程中會自然凋亡
C. 與抗原結合後，可藉由 Ig 與 Ig 傳遞訊息，使細胞活化
D. 血液中 B 細胞的數目多於嗜中性白血球（neutrophil）

正確答案：D. 血液中 B 細胞的數目多於嗜中性白血球（neutrophil）